Nocturnal oxygen therapy.

The above is a clinical trial exclusion criterion. Annotated with entity spans:
[Procedure: Nocturnal oxygen therapy].